某醫師追蹤研究長期服用避孕藥可能發生的副作用，該研究的觀察偏差（observation bias）可能發生在下列那一項？
A. 評估避孕藥服用情形
B. 追蹤調查病人參與情形
C. 評估副作用的發生情形
D. 統計分析、結果報告

正確答案：C. 評估副作用的發生情形